4. Left ventricular ejection fraction less than 20%.

The above is a clinical trial exclusion criterion. Annotated with entity spans:
4. [Measurement: Left ventricular ejection fraction] [Value: less than 20%].